第 8 及第 14 染色體轉位 t（8;14）和下列何者關聯性最高？
A. 神經母細胞瘤（neuroblastoma）
B. 威爾姆氏腫瘤（Wilms tumor）
C. 急性淋巴性白血病（acute lymphoblastic leukemia）
D. 非霍杰金氏淋巴瘤（non-Hodgkin lymphoma）

正確答案：D. 非霍杰金氏淋巴瘤（non-Hodgkin lymphoma）